Subject has evidence of congestive heart failure (NYHA class II, III or IV) in sinus rhythm.

The above is a clinical trial exclusion criterion. Annotated with entity spans:
Subject has evidence of [Condition: congestive heart failure] ([Measurement: NYHA class] [Value: II], [Value: III] or [Value: IV]) in [Condition: sinus rhythm].